Men or women, 18 to 65 years old with a BMI of 35 kg/m2 or greater who will be undergoing bariatric surgery (VSG and RYGB)

The above is a clinical trial inclusion criterion. Annotated with entity spans:
[Person: Men] or [Person: women], [Value: 18 to 65 years] [Person: old] with a [Measurement: BMI] of [Value: 35 kg/m2 or greater] who will be undergoing [Procedure: bariatric surgery] ([Procedure: VSG] and [Procedure: RYGB])